¿Qué proporción de insulina y péptido C sintetizan las células beta de los islotes de Langerhans?
1. Una molécula de insulina por cada péptido C.
2. Dos moléculas de insulina por cada péptido C.
3. Una molécula de insulina por cada dos péptidos C.
4. El péptido C se sintetiza en las células C.
5. Existe proporción variable entre la síntesis de insulina y la de péptido C.

Respuesta correcta: 1. Una molécula de insulina por cada péptido C.